Which technique led to the elucidation of the role of HOXD10 in regulating lymphatic endothelial responses to VEGF-C?

DeepCAGE transcriptomics identify HOXD10 as a transcription factor regulating lymphatic endothelial responses to VEGF-C